CYP2C8 substrates such as thiazolidinediones (glitazones) and select statins (because of expected inhibition of the metabolism of CYP2C8 substrates) by venetoclax

The above is a clinical trial exclusion criterion. Annotated with entity spans:
[Drug: CYP2C8 substrates] such as [Drug: thiazolidinediones] ([Drug: glitazones]) and [Qualifier: select] [Drug: statins] (because of expected inhibition of the metabolism of CYP2C8 substrates) by venetoclax